Subjects with known cardiac abnormalities (atrial septal defects or ventricular septal defects, severe tricuspid valve disease, severe pulmonary hypertension, Ejection fraction < 15%)

The above is a clinical trial exclusion criterion. Annotated with entity spans:
Subjects with known [Condition: cardiac abnormalities] ([Condition: atrial septal defects] or [Condition: ventricular septal defects], [Qualifier: severe] [Condition: tricuspid valve disease], [Qualifier: severe] [Condition: pulmonary hypertension], [Measurement: Ejection fraction] [Value: < 15%])